Clinical trial exclusion criterion:
Monitored Anesthesia Care (i.e., regional anesthesia alone without plans for general anesthesia)

Annotated entities:
- Procedure: "Monitored Anesthesia Care"
- Procedure: "regional anesthesia"
- Multiplier: "alone"
- Negation: "without"
- Mood: "plans for"
- Procedure: "general anesthesia"